Clinical trial exclusion criterion:
Previous enrolment in this study or treatment with an investigational drug or device under another study protocol in the past 30 days.

Entity relations:
- multi("treatment with an investigational drug", "investigational drug")
- Has_temporal("treatment with an investigational drug", "Previous")
- Has_temporal("enrolment in this study", "Previous")
- Has_temporal("device", "Previous")
- OR("enrolment in this study", "device", "treatment with an investigational drug")